Clinical trial inclusion criterion:
Patient is indicated to have an ocular refractive surgery performed (myopia, astigmatism, hypermetropy) by the Lasik method.

Entity relations:
- AND("indicated to have an ocular refractive surgery performed", "ocular refractive surgery")
- Has_qualifier("ocular refractive surgery", "Lasik method")
- Subsumes("indicated to have an ocular refractive surgery performed", "myopia")
- OR("myopia", "astigmatism", "hypermetropy")